Clinical trial inclusion criterion:
Patient presents with acute coronary syndrome (ACS) or stable coronary artery disease (CAD)

Annotated entities:
- Condition: "acute coronary syndrome"
- Condition: "ACS"
- Condition: "coronary artery disease"
- Condition: "CAD"
- Qualifier: "stable"